Clinical trial inclusion criterion:
obese : weight for height > median + 3 standard deviations

Entity relations:
- Has_value("weight for height", "> median + 3 standard deviations")
- Subsumes("obese", "weight for height")